一位 3 個月大之男嬰，腹瀉及發燒約 5 天。病史顯示其出生時有解胎便延遲，並自那時起即有便秘。 理學檢查發現男嬰活力不佳，有高燒並有腹脹等症狀。此男嬰最可能有下列何種疾病？
A. 毒性巨腸（toxic megacolon）
B. 幽門狹窄（pyloric stenosis）
C. 小腸絞轉（volvulus）
D. 腸套疊（intussusception）

正確答案：A. 毒性巨腸（toxic megacolon）